Acute clinically significant pulmonary, cardiovascular, hepatic or renal functional abnormality, as determined by physical examination or laboratory screening tests.

The above is a clinical trial exclusion criterion. Annotated with entity spans:
Acute clinically significant [Condition: pulmonary], [Condition: cardiovascular], [Condition: hepatic] or [Condition: renal functional abnormality], as determined by physical examination or laboratory screening tests.